What datasets are available related to Duchenne Muscular Dystrophy?

Using data from the Muscular Dystrophy Surveillance, Tracking, and Research Network (MD STARnet)